Clinical trial inclusion criterion:
Prior pelvic radiotherapy except as part of combination therapy for prostate cancer

Annotated entities:
- Temporal: "Prior"
- Qualifier: "pelvic"
- Procedure: "radiotherapy"
- Negation: "except"
- Procedure: "combination therapy"
- Condition: "prostate cancer"
- Condition: "prostate cancer"